Aspirin 是常見之止痛藥，它的廣效性作用是：
A. PGE2合成的刺激物
B. phospholipase 的抑制物
C. cyclooxygenase 的抑制物
D. arachidonic acid 合成的刺激物

正確答案：C. cyclooxygenase 的抑制物